Clinical trial exclusion criterion:
Claustrophobia

Annotated entities:
- Condition: "Claustrophobia"